下列小腦皮質部細胞中，何者屬於分泌glutamate的興奮性神經元？
A. Purkinje cells
B. Golgi cells
C. granule cells
D. basket cells

正確答案：C. granule cells